Clinical trial exclusion criterion:
Patients with congenital anomalies, chromosomal anomalies, or heart defects.

Annotated entities:
- Condition: "congenital anomalies"
- Condition: "chromosomal anomalies"
- Condition: "heart defects"